診斷胃癌最好的方法為何？
A. 內視鏡
B. 腹部超音波
C. 腹部電腦斷層
D. 上消化道攝影

正確答案：A. 內視鏡